MDD Cohort: Meet DSM-5 criteria for Major Depressive Disorder by structured interview (MINI-KID); CDRS-R score >40; Failure to achieve remission with at least 1 adequate prior antidepressant trial (e.g. SSRI, SNRI, or TCA), meaning at least 8 weeks at therapeutic dosing, including at least 4 weeks of stable dosing.

The above is a clinical trial inclusion criterion. Annotated with entity spans:
[Observation: MDD Cohort]: Meet [Qualifier: DSM-5 criteria] for [Condition: Major Depressive Disorder] by [Procedure: structured interview] ([Procedure: MINI-KID]); [Measurement: CDRS-R score] [Value: >40]; [Negation: Failure] to achieve [Condition: remission] with [Multiplier: at least 1] [Qualifier: adequate] [Temporal: prior] [Procedure: antidepressant trial] (e.g. [Drug: SSRI], [Drug: SNRI], or [Drug: TCA]), meaning [Multiplier: at least 8 weeks] at [Procedure: therapeutic dosing], including [Multiplier: at least 4 weeks] of [Procedure: stable dosing].